下列那一條肋間靜脈（intercostal vein），通常不匯入奇靜脈（azygos vein）系統？
A. 左側第八肋間靜脈
B. 左側第一肋間靜脈
C. 右側第三肋間靜脈
D. 右側第十肋間靜脈

正確答案：B. 左側第一肋間靜脈